La liberación de amoniaco de los aminoácidos está catalizada por:
1. Transaminasas y deshidratasas.
2. Transaminasas y aminoácido oxidasas.
3. Transaminasas y glutamato deshidrogenasa.
4. Deshidratasas y glutamato deshidrogenasa.

Respuesta correcta: 3. Transaminasas y glutamato deshidrogenasa.